Which microRNAs are involved in targeting CYLD in triple negative breast cancer?

Mir-182 and miR-301b are involved in targeting CYLD in triple negative breast cancer.